Clinical trial exclusion criterion:
Morbidly obese patients (BMI >47 kg/m2) and overweight/lean patients (BMI <27 kg/m2)

Annotated entities:
- Condition: "Morbidly obese"
- Measurement: "BMI"
- Value: ">47 kg/m2"
- Condition: "overweight"
- Condition: "lean"
- Measurement: "BMI"
- Value: "<27 kg/m2"